Written informed consent

The above is a clinical trial inclusion criterion. Annotated with entity spans:
[Post-eligibility: Written informed consent]